Cardio-vascular pathologies, evoluting and uncontrolled, (severe HTA), cardiac deficiency, severe angor, severe arrhythmia.

The above is a clinical trial exclusion criterion. Annotated with entity spans:
[Condition: Cardio-vascular pathologies], [Qualifier: evoluting] and [Qualifier: uncontrolled], ([Qualifier: severe] [Condition: HTA]), [Condition: cardiac deficiency], [Qualifier: severe] [Condition: angor], [Qualifier: severe] [Condition: arrhythmia].